某確診思覺失調症（schizophrenia）之年輕男病患，開始接受抗精神病藥物 （antipsychotics）治療，治療第三天時，突然出現眼球上吊之情形，此時之處置不包括：
A. 給予抗膽鹼藥物（anticholinergics）
B. 降低抗精神病藥物劑量或調整抗精神病藥物種類
C. 給予肌肉鬆弛劑（muscle relaxant）
D. 排除其它可能之神經疾患，如：癲癇

正確答案：C. 給予肌肉鬆弛劑（muscle relaxant）